Clinical trial inclusion criterion:
Allograft functioning at an acceptable level as defined by the AST, ALT, Total Bilirubin levels =3 times ULN prior to enrollment.

Annotated entities:
- Measurement: "Allograft functioning"
- Value: "acceptable level"
- Measurement: "AST"
- Measurement: "ALT"
- Measurement: "Total Bilirubin"
- Value: "=3 times ULN"
- Temporal: "prior to enrollment"